supplemental oxygen requirement (< 3 months)

The above is a clinical trial exclusion criterion. Annotated with entity spans:
[Procedure: supplemental oxygen] [Mood: requirement] ([Temporal: < 3 months])